Planned surgery under regional anesthesia

The above is a clinical trial exclusion criterion. Annotated with entity spans:
[Mood: Planned] [Procedure: surgery] under [Procedure: regional anesthesia]